Clinical trial inclusion criterion:
Patient is aged 18 years and over (>=21y in Singapore).

Entity relations:
- Has_value("Singapore", ">=21y")
- Has_value("aged", "18 years and over")
- OR("18 years and over", "Singapore")